Clinical trial exclusion criterion:
Expected life span<6-month

Entity relations:
- Has_value("Expected life span", "<6-month")